Clinical trial exclusion criterion:
Subject has any untreated or uncontrolled hyperthyroidism or hypothyroidism.

Entity relations:
- Has_qualifier("hyperthyroidism", "untreated")
- OR("untreated", "uncontrolled")
- OR("hyperthyroidism", "hypothyroidism")